下列有關乳糖（lactose）之消化吸收及代謝之敘述，何者正確？
A. 胰臟分泌乳糖酶（lactase）消化乳糖
B. 成人之乳糖酶（lactase）會上升且與種族有關
C. 乳糖不耐症會造成滲透性腹瀉（osmotic diarrhea）
D. 半乳糖血症（galactosemia）是因攝食過量乳糖所致

正確答案：C. 乳糖不耐症會造成滲透性腹瀉（osmotic diarrhea）